Subjects who aspartate transaminase/alkaline transaminase (AST/ALT) value is more than three times of the upper limit of the normal range at screening test

The above is a clinical trial exclusion criterion. Annotated with entity spans:
Subjects who [Measurement: aspartate transaminase/alkaline transaminase (AST/ALT)] value is [Value: more than three times of the upper limit of the normal range] [Temporal: at screening test]